Clinical trial exclusion criterion:
Renal failure (Cl Cr < 60 mL /min /1,73m),

Entity relations:
- Has_value("Cl Cr", "< 60 mL /min /1,73m")
- AND("Renal failure", "Cl Cr")